History or current clinical evidence of moderate-to-severe fixed obstructive pulmonary disease or severe reactive airway diseases (e.g., asthma) requiring hospitalization within the past 2 years or patient currently using long-term inhaled bronchodilators

The above is a clinical trial exclusion criterion. Annotated with entity spans:
[Temporal: History] or [Temporal: current] [Mood: clinical evidence of] [Qualifier: moderate-to-severe] [Qualifier: fixed] [Condition: obstructive pulmonary disease] or [Qualifier: severe] [Condition: reactive airway diseases] (e.g., [Condition: asthma]) [Mood: requiring] [Procedure: hospitalization] [Temporal: within the past 2 years] or patient [Temporal: currently] using [Drug: long-term inhaled bronchodilators]